La Amercian Psychiatric Association (1994) definió la enfermedad mental como:
1. Un síndrome que tiene manifestaciones psicológicas o conductuales asociadas a una alteración del funcionamiento secundaria a una anomalía social, psicológica, genética, fisicoquímica o biológica.
2. Un trastorno limitado exclusivamente a la persona que lo padece.
3. La aceptación por parte del enfermo de sus actos.
4. La posibilidad de la persona para afrontar el estrés.
5. Una enfermedad que confina a las personas a los asilos y manicomios.

Respuesta correcta: 1. Un síndrome que tiene manifestaciones psicológicas o conductuales asociadas a una alteración del funcionamiento secundaria a una anomalía social, psicológica, genética, fisicoquímica o biológica.